Clinical trial exclusion criterion:
History of any use of citalopram or escitalopram during the current episode or need for drugs that may interact with these agents, i.e. drug metabolized by the 2D6 P450 isoenzyme system;

Annotated entities:
- Drug: "citalopram"
- Drug: "escitalopram"
- Qualifier: "current"
- Condition: "episode"
- Drug: "drugs"
- Drug: "agents"
- Non-query-able: "need for drugs that may interact with these agents, i.e. drug metabolized by the 2D6 P450 isoenzyme system"